Clinical trial inclusion criterion:
treatment-naive patients with lymphoma

Annotated entities:
- Observation: "treatment-naive"
- Condition: "lymphoma"